Clinical trial exclusion criterion:
cardiac disease

Annotated entities:
- Condition: "cardiac disease"